Clinical trial exclusion criterion:
contraindications to neuraxial anesthesia or require general anesthesia for CD

Annotated entities:
- Condition: "contraindications"
- Procedure: "neuraxial anesthesia"
- Mood: "require"
- Procedure: "general anesthesia"
- Procedure: "CD"